正常人尿液中的酸，主要以何種形式排泄？
A. H+
B. NH4+
C. H3PO4
D. HPO42-

正確答案：B. NH4+